El ciprofloxacino es un ejemplo de quinolona antibacteriana. ¿Qué sustituyente lleva sobre el nitrógeno de la posición 1?
1. Ciclopropilo.
2. Acetilo.
3. Fenilo.
4. Está sin sustituir.
5. Hidroxilo.

Respuesta correcta: 1. Ciclopropilo.